Clinical trial exclusion criterion:
Known allergy to any drug used

Entity relations:
- AND("Known allergy", "any drug used")